關於感染性食物中毒之敘述，下列那一項最不適當？
A. 臺灣細菌性食物中毒以大腸桿菌為最常見
B. 近年來腸道出血性大腸桿菌感染症曾在美、日等國造成大規模食因性感染，其血清型為 O157：H7
C. 細菌性食物中毒的治療，主要為靜脈輸液以預防並矯正體液、電解質不平衡，當病人產生意識障礙或有嘔吐物阻塞呼吸道的疑慮時，則要注意保持呼吸道的暢通並給予氧氣
D. 常見病徵如急性腹痛、噁心、嘔吐、下痢、頭暈等

正確答案：A. 臺灣細菌性食物中毒以大腸桿菌為最常見